Clinical trial exclusion criterion:
1. Patients over the age of 85 years except at the discretion of the Investigator and with agreement of the Sponsor.

Entity relations:
- Has_value("age", "over the age of 85 years")